Clinical trial exclusion criterion:
Patients with previous periorbital/forehead surgery

Entity relations:
- OR("periorbital surgery", "forehead surgery")